Clinical trial exclusion criterion:
Subject who the investigator deems inappropriate to participate in this study

Annotated entities:
- Non-query-able: "Subject who the investigator deems inappropriate to participate in this study"